Clinical trial exclusion criterion:
Previous exposure to cytotoxic drugs or pelvic irradiation.

Entity relations:
- AND("exposure", "cytotoxic drugs")
- OR("cytotoxic drugs", "pelvic irradiation")